La estructura denominada cremallera de leucinas se encuentra en determinadas proteínas y es un dominio:
1. De interacción proteína-proteína en proteínas reguladoras de la expresión.
2. Típico de las histonas H3 y H4 en su unión al DNA.
3. De interacción con el DNA a través del surco menor.
4. Que inicialmente es de isoleucinas, pero que se transforma en leucinas durante la maduración post-traduccional.

Respuesta correcta: 1. De interacción proteína-proteína en proteínas reguladoras de la expresión.